下列何者不是體蝨（body louse）傳播的疾病？
A. 恙蟲病（scrub typhus）
B. 流行性斑疹傷寒（epidemic typhus）
C. 回歸熱（relapsing fever）
D. 戰壕熱（trench fever）

正確答案：A. 恙蟲病（scrub typhus）